Clinical trial inclusion criterion:
Newly-diagnosed gynecologic cancer patients in whom SLN mapping and surgical excision is indicated OR

Annotated entities:
- Condition: "gynecologic cancer"
- Procedure: "SLN mapping"
- Procedure: "surgical excision"
- Condition: "surgical excision is indicated"
- Condition: "SLN mapping is indicated"